Clinical trial exclusion criterion:
History of seizures

Annotated entities:
- Condition: "seizures"